score level D on the SIGAM mobility grade

The above is a clinical trial exclusion criterion. Annotated with entity spans:
score [Value: level D] on the [Measurement: SIGAM mobility grade]